Patients who have received any other investigational drug or device within 3 months;

The above is a clinical trial exclusion criterion. Annotated with entity spans:
[Competing_trial: Patients who have received any other investigational drug or device within 3 months;]